Psychological and / or cognitive impairments that restrict them to respond to questionnaires;

The above is a clinical trial exclusion criterion. Annotated with entity spans:
[Condition: Psychological] and / or [Condition: cognitive impairments] that [Qualifier: restrict them to respond to questionnaires];